Clinical trial exclusion criterion:
Pregnant women

Annotated entities:
- Pregnancy_considerations: "Pregnant women"